Clinical trial exclusion criterion:
History of hypersensitivity to ARBs or dihydropyridines

Entity relations:
- AND("hypersensitivity", "ARBs")
- Has_temporal("hypersensitivity", "History of")
- OR("ARBs", "dihydropyridines")